Participants must present a diagnosis of osteoporosis based on DXA measurement of the bone mineral density at the femur neck and/or total hip and/or lumbar spine (T value 2.5 SD or more below the young female adult mean) within the past 24 months.

The above is a clinical trial inclusion criterion. Annotated with entity spans:
Participants must present a diagnosis of [Condition: osteoporosis] based on [Procedure: DXA] measurement of the [Measurement: bone mineral density] at the [Qualifier: femur neck] and/or [Qualifier: total hip] and/or [Qualifier: lumbar spine] ([Measurement: T value] [Value: 2.5 SD or more below the young female adult mean]) within the [Temporal: past 24 months].